History of a positive Hepatitis B surface antigen (HBsAg) or Hepatitis C test result.

The above is a clinical trial exclusion criterion. Annotated with entity spans:
[Temporal: History] of a [Value: positive] [Measurement: Hepatitis B surface antigen (HBsAg)] or [Measurement: Hepatitis C test] result.